systemic disorders such as diabetes, rheumatoid arthritis, haematological diseases (coagulopathy), severe cardiovascular diseases, infections, immunodepression;

The above is a clinical trial exclusion criterion. Annotated with entity spans:
[Condition: systemic disorders] such as [Condition: diabetes], [Condition: rheumatoid arthritis], [Condition: haematological diseases] ([Condition: coagulopathy]), [Qualifier: severe] [Condition: cardiovascular diseases], [Condition: infections], [Condition: immunodepression];